Clinical trial inclusion criterion:
Creatinine clearance (CrCl) greater than or equal to 60 mL/min, either measured or estimated by Cockcroft-Gault equation. NOTE: A calculator for estimating the CrCl can be found at www.fstrf.org/ACTG/ccc.html

Annotated entities:
- Measurement: "Creatinine clearance (CrCl)"
- Value: "greater than or equal to 60 mL/min"
- Procedure: "Cockcroft-Gault equation"